Clinical trial exclusion criterion:
Age less than 18 years

Annotated entities:
- Person: "Age"
- Value: "less than 18 years"